Clinical trial exclusion criterion:
Psychiatric troubles that do not allow the protocol follow-up.

Entity relations:
- Has_qualifier("Psychiatric troubles", "do not allow the protocol follow-up")